足月產的新生兒，出生體重3500公克，出生後第5天體重4200公克，腎臟超音波顯示有雙側水腎 （hydronephrosis）及輸尿管擴大（hydroureter），膀胱壁厚而不規則，下列何者為最可能的診斷？
A. 膀胱輸尿管逆流（bilateral vesicoureteral reflux）
B. 後尿道瓣（posterior urethral valves）
C. 輸尿管膀胱接合處阻塞（ureterovesical junction stenosis）
D. 輸尿管腎盂接合處阻塞（ureteropelvic junction stenosis）

正確答案：B. 後尿道瓣（posterior urethral valves）